手術前的「核心呼吸道評估（core of airway assessment）」中，最能預測潛在性困難呼吸道的三個理學檢查項目，不包括下列何者？
A. 嘴巴打開的程度（mouth opening）
B. 頭圍大小（circumference of the head）
C. 下顎前挺程度（jaw protrusion）
D. 頭部伸展程度（head extension）

正確答案：B. 頭圍大小（circumference of the head）